Clinical trial exclusion criterion:
patients with haemodynamic instability of septic origin or a respiratory insufficiency (defined by a ratio Pa02/Fi02 = 200 mmHg and PEP = 5 cmH2O)

Entity relations:
- AND("haemodynamic instability", "septic")
- Has_value("Pa02/Fi02", "= 200 mmHg")
- Has_value("PEP", "= 5 cmH2O")
- AND("espiratory insufficiency", "Pa02/Fi02")
- AND("espiratory insufficiency", "PEP")
- OR("haemodynamic instability", "espiratory insufficiency")